依照 British Medical Research Council 的 muscle-grading scale，正常的肌力是：
A. Muscle grade 1
B. Muscle grade 3
C. Muscle grade 5
D. Muscle grade 6

正確答案：C. Muscle grade 5